evidence of arthritis on x-ray,

The above is a clinical trial exclusion criterion. Annotated with entity spans:
[Mood: evidence of] [Condition: arthritis] on [Procedure: x-ray],